Clinical trial exclusion criterion:
Patients who are allergic to IP or macrolide compounds.

Entity relations:
- AND("allergic", "IP")
- OR("IP", "macrolide")